Clinical trial exclusion criterion:
Inability to perform exercise tests

Annotated entities:
- Condition: "Inability to perform"
- Procedure: "exercise tests"